Clinical trial exclusion criterion:
systemic conditions associated with chronic pain

Annotated entities:
- Condition: "systemic conditions"
- Qualifier: "associated with chronic pain"
- Condition: "chronic pain"